Clinical trial inclusion criterion:
Accident & Emergency Department patients, requiring parenteral drug sedation (as determined by an emergency clinician) will be enrolled.

Entity relations:
- Has_mood("parenteral drug sedation", "requiring")